關於肺部物理治療（chest physical therapy）中的呼吸運動（breathing exercises），下列何者描述錯誤？
A. 在教導呼吸運動（breathing exercises）前，通常要先學習放鬆技巧（relaxation technique）
B. 慢性阻塞性肺疾病（COPD）患者的呼吸運動（breathing exercises）包括撅唇呼吸（pursed lip breathing）並強調快而淺的呼吸法（fast shallow breathing）
C. 撅唇呼吸（pursed lip breathing）的作用在於維持呼氣期氣道的正壓（maintain positive airway pressure during exhalation）
D. 慢性阻塞性肺疾病（COPD）患者雖然常被教導橫膈膜式呼吸方式（diaphragmatic breathing），但對這群患者而言，橫膈膜式呼吸方式可能比自然呼吸方式（natural pattern of breathing）消耗更多的呼吸功

正確答案：B. 慢性阻塞性肺疾病（COPD）患者的呼吸運動（breathing exercises）包括撅唇呼吸（pursed lip breathing）並強調快而淺的呼吸法（fast shallow breathing）